Clinical trial exclusion criterion:
Ongoing cord compression or a syrinx in the spinal cord or who suffer from a spinal cord disease such as spinal stenosis, spina bifida or herniated cervical disk.

Entity relations:
- Has_qualifier("syrinx", "spinal cord")
- Subsumes("spinal cord disease", "spinal stenosis")
- OR("cord compression", "spinal cord disease", "syrinx")
- OR("spinal stenosis", "spina bifida", "herniated cervical disk")